Clinical trial exclusion criterion:
Renal or hepatic insufficiency

Entity relations:
- OR("Renal insufficiency", "hepatic insufficiency")